Clinical trial exclusion criteria:
Non- English speakers
Height < 4' 11"
BMI >40 Kg/ mm
Antiemetic drug use in the 24 hours prior to cesarean delivery,
Hypertensive diseases of pregnancy
Chronic hypertension receiving antihypertensive treatment
Any other physical or psychiatric condition that may impair their ability to cooperate with study data collection.

Annotated entities:
- Observation: "Non- English speakers"
- Measurement: "Height"
- Value: "< 4' 11""
- Observation: "BMI"
- Value: ">40 Kg/ mm"
- Drug: "Antiemetic drug"
- Temporal: "in the 24 hours prior to cesarean delivery"
- Reference_point: "cesarean delivery"
- Procedure: "cesarean delivery"
- Condition: "Hypertensive diseases of pregnancy"
- Condition: "Chronic hypertension"
- Procedure: "antihypertensive treatment"
- Post-eligibility: "Any other physical or psychiatric condition that may impair their ability to cooperate with study data collection."